En relación con el tratamiento de una mujer no fumadora con carcinoma de pulmón no microcítico, adenocarcinoma estadio IV, ¿cuál de las siguientes afirmaciones es correcta?
1. Es obligado hacer la determinación de la mutación del receptor del factor de crecimiento epidérmico (EGFR).
2. Gefitinib de entrada es el tratamiento estándar sin determinación de EGFR.
3. Tiene un tratamiento estándar basado en camptotecinas.
4. Cualquier tipo de quimioterapia estándar es válido.
5. No hay ningún factor predictivo para esta enfermedad.

Respuesta correcta: 1. Es obligado hacer la determinación de la mutación del receptor del factor de crecimiento epidérmico (EGFR).